use of EEA stapler anastomosis

The above is a clinical trial inclusion criterion. Annotated with entity spans:
use of [Device: EEA stapler anastomosis]